8. Other malignancy within 2 years prior to Day 1 of the study, except for those treated with surgical intervention only.

The above is a clinical trial exclusion criterion. Annotated with entity spans:
[Parsing_Error: 8.] Other [Condition: malignancy] [Temporal: within 2 years prior to Day 1 of the study], [Negation: except for] [Condition: those] treated with [Procedure: surgical intervention] only.